Clinical trial inclusion criterion:
4. Onset > 6 months

Annotated entities:
- Parsing_Error: "4."
- Temporal: "Onset > 6 months"